Hostility or refusal to cooperate

The above is a clinical trial exclusion criterion. Annotated with entity spans:
[Observation: Hostility] or [Observation: refusal to cooperate]